Un Pediatra desea estudiar el sobrepeso en los niños de 14 años, según los valores del IMC (índice de masa corporal). Para estimar el tamaño muestral necesario propone un nivel de confianza del 95% y una precisión de 1 unidad de IMC. ¿Qué más parámetros necesita conocer para determinar el tamaño muestral?
1. La media del IMC en la población.
2. La varianza del IMC.
3. La media y la desviación típica del IMC.
4. El tamaño de la población y la media del IMC.
5. La desviación típica del IMC y el tamaño de población.

Respuesta correcta: 2. La varianza del IMC.